Clinical trial inclusion criterion:
Patients with Moderate to Advanced Chronic periodontitis

Entity relations:
- Has_qualifier("Chronic periodontitis", "Moderate")
- OR("Moderate", "Advanced")